1歲半兒童被帶來門診想接受疫苗注射，在他11個月大時，曾因病接受免疫球蛋白（IVIG）的治療。下列何種疫苗之補接種較為適合？
A. 麻疹－德國麻疹－腮腺炎疫苗
B. 水痘疫苗
C. A型肝炎疫苗
D. 活性日本腦炎疫苗

正確答案：C. A型肝炎疫苗